Clinical trial exclusion criterion:
Patients who have received any investigational drug in the 30 days prior to their inclusion in this study.

Annotated entities:
- Competing_trial: "Patients who have received any investigational drug in the 30 days prior to their inclusion in this study."